Clinical trial exclusion criterion:
5. Osteomyelitis or prosthetic joint infection except new onset nonhardware-associated vertebral osteomyelitis.

Entity relations:
- Has_qualifier("vertebral osteomyelitis", "nonhardware-associated")
- Has_temporal("vertebral osteomyelitis", "new onset")
- Has_negation("vertebral osteomyelitis", "except")
- OR("Osteomyelitis", "prosthetic joint infection")